between 16-25 years of age

The above is a clinical trial inclusion criterion. Annotated with entity spans:
between [Value: 16-25 years] of [Person: age]